Señale la respuesta correcta respecto al índice de Lawton como escala de valoración en geriatría:
1. Debido a su complejidad para ser aplicada, precisa que el entrevistador haya sido entrenado previamente.
2. Debe ser siempre aplicada por observación directa de la persona evaluada.
3. Varios de sus ítems se relacionan con tareas domésticas.
4. Evalúa las actividades avanzadas de la vida diaria.
5. Muchos de sus ítems valoran actividades asociadas al rol masculino.

Respuesta correcta: 3. Varios de sus ítems se relacionan con tareas domésticas.